History of hypersensitivity to EACA

The above is a clinical trial exclusion criterion. Annotated with entity spans:
History of [Condition: hypersensitivity] to [Drug: EACA]